Allergy to liraglutide or any of the active ingredients in liraglutide or other GLP-1 analogue

The above is a clinical trial exclusion criterion. Annotated with entity spans:
[Condition: Allergy] to [Drug: liraglutide] or any of the active ingredients in liraglutide or other [Drug: GLP-1 analogue]